Ability to understand and willingness to sign a written informed consent document

The above is a clinical trial inclusion criterion. Annotated with entity spans:
[Non-query-able: Ability to understand and willingness to sign a written informed consent document]